Clinical trial exclusion criterion:
Diagnosis of gestational trophoblastic disease

Annotated entities:
- Condition: "gestational trophoblastic disease"